Clinical trial inclusion criterion:
Give written informed consent

Annotated entities:
- Post-eligibility: "Give written informed consent"